Clinical trial inclusion criterion:
The diagnosis of mild-severe acute exacerbation of chronic bronchitis (AECB)

Annotated entities:
- Qualifier: "mild-severe"
- Qualifier: "acute"
- Condition: "exacerbation of chronic bronchitis"
- Condition: "AECB"